一位 36 歲女性，於夜間入睡前會感到下肢明顯痠麻不適，需要下床活動才會舒服些，此症狀嚴重影響其睡眠，下列那一種血中物質的缺乏可能與此疾病有關？
A. 鎂（magnesium）
B. 鉀（potassium）
C. 磷（phosphorus）
D. 鐵（iron）

正確答案：D. 鐵（iron）